How many groups of viruses exist  in the Baltimore Classification?

The Baltimore Classification system consists of seven classes (A, B, C, D, E, F, G, C and D) that are classified into seven different regions based on sequence similarity.